Participation in clinical trials or undergoing other investigational procedures within 30 days prior to Day 1

The above is a clinical trial exclusion criterion. Annotated with entity spans:
[Observation: Participation in clinical trials] or [Observation: undergoing other investigational procedures] [Temporal: within 30 days prior to Day 1]